若病患為巨母紅血球性貧血（megaloblastic anemia），且其不具神經性異常（neurological abnormalities）症狀者，則應以下列何藥治療？
A. Iron
B. Vitamin B12
C. Folate
D. Erythropoietin

正確答案：C. Folate